What is CellMaps?

CellMaps is an HTML5 open-source web tool that allows displaying, editing, exploring and analyzing biological networks as well as integrating metadata into them. CellMaps can easily be integrated in any web page by using an available JavaScript API. Computations and analyses are remotely executed in high-end servers, and all the functionalities are available through RESTful web services.